Clinical trial exclusion criterion:
Unable to walk (ex: wheelchair subjects)

Annotated entities:
- Condition: "Unable to walk"
- Observation: "wheelchair subjects"